Organic mental disease, including mental retardation.

The above is a clinical trial exclusion criterion. Annotated with entity spans:
[Condition: Organic mental disease], including [Condition: mental retardation].